下列有關急性炎症（acute inflammation）之血管反應，何者正確？
A. 自血管滲出之液體主要為漏出液（transudate）
B. 血管擴張是由於組織胺（histamine）及一氧化氮（nitric oxide, NO）等作用在血管內皮（endothelium）所致
C. 血管滲透性（permeability）增加的最常見機轉是血管內皮受損、細胞壞死及脫落所致
D. 血管內皮細胞收縮導致血管滲漏是因為組織胺（histamine）、遲緩激肽（bradykinin）等物質所引起

正確答案：D. 血管內皮細胞收縮導致血管滲漏是因為組織胺（histamine）、遲緩激肽（bradykinin）等物質所引起